下列有關老人醫學（geriatric medicine）的觀念描述，何者錯誤？
A. 老年人疾病表現較年輕人不典型
B. 當身體受到同樣的輕微傷害時，老年人可能會發生較年輕人嚴重的病況
C. 老年人的臨床症狀常會由多種原因及多重器官系統異常所造成
D. 因成本效益的理由，老年人較不必注重疾病的預防

正確答案：D. 因成本效益的理由，老年人較不必注重疾病的預防